下列物質於血液中的濃度上升與粥狀動脈硬化（atherosclerosis）發生有關，但何者除外？
A. C-reactive protein
B. 高密度脂蛋白（high-density lipoprotein）
C. 同半胱胺酸（homocysteine）
D. 血糖

正確答案：B. 高密度脂蛋白（high-density lipoprotein）